Clinical trial exclusion criterion:
Associated neuromuscular disorders, contraindication for the use of rocuronium/ sugammadex, allergy or hypersensitivity to rocuronium / sugammadex

Entity relations:
- AND("contraindication", "rocuronium")
- AND("allergy", "rocuronium")
- OR("rocuronium", "sugammadex")
- OR("rocuronium", "sugammadex")
- OR("allergy", "hypersensitivity")